有關免疫抑制劑sirolimus（rapamycin）之敘述，下列何者錯誤？
A. 可結合到FK506-binding protein
B. 如同tacrolimus可以抑制calcineurin作用
C. 比cyclosporine較少有腎功能損傷不良作用
D. 抑制mTOR而抑制蛋白合成

正確答案：B. 如同tacrolimus可以抑制calcineurin作用